History of previous open-laparotomy.

The above is a clinical trial exclusion criterion. Annotated with entity spans:
[Temporal: History] of [Temporal: previous] [Procedure: open-laparotomy].